What is the function of the Nup153 protein?

Nup153 is a large (153 kD) O-linked glyco-protein which is a component of the basket structure located on the nucleoplasmic face of nuclear pore complexes. Nup153 is a nucleoporin mediating nuclear import. In addition to being important to pore architecture, Nup153 is a key participant in both import and export. During the transition into mitosis, Nup153 directs proteins involved in membrane remodeling to the nuclear envelope.